Entre los criterios epidemiológicos de causalidad definidos por Bradford Hill (1965) NO se encuentra:
1. Fuerza de asociación.
2. Secuencia temporal.
3. Gradiente biológico.
4. Efecto de cesación o reversibilidad.
5. Presencia de explicaciones alternativas.

Respuesta correcta: 5. Presencia de explicaciones alternativas.